Normal serum TSH within 12 months preceding surgery

The above is a clinical trial inclusion criterion. Annotated with entity spans:
[Value: Normal] [Measurement: serum TSH] [Temporal: within 12 months preceding surgery]